Clinical trial inclusion criterion:
Subject has known CD and a recent history (within last 2 years) of mucosal disease (diagnosis based on radiologic, endoscopic, or histological evidence).

Annotated entities:
- Condition: "mucosal disease"
- Observation: "radiologic evidence"
- Observation: "endoscopic evidence"
- Observation: "histological evidence"
- Temporal: "within last 2 years"
- Temporal: "recent history"
- Undefined_semantics: "CD"